Sedation and mechanical ventilation planned > 2 days

The above is a clinical trial inclusion criterion. Annotated with entity spans:
[Procedure: Sedation] and [Procedure: mechanical ventilation] [Mood: planned] [Temporal: > 2 days]